Clinical trial inclusion criterion:
Manual manoeuvres to facilitate =25% of defecations

Annotated entities:
- Condition: "defecations"
- Multiplier: "=25%"
- Procedure: "Manual manoeuvres"